Clinical trial exclusion criterion:
Loss of function is expected to be improved by reliable tendon transfer, tenodesis or arthrodesis that is available

Annotated entities:
- Observation: "Loss of function"
- Mood: "improved by"
- Procedure: "tendon transfer"
- Procedure: "tenodesis"
- Procedure: "arthrodesis"